Clinical trial exclusion criteria:
Less than 18 years of age;
Pregnancy;
Chronic use of vitamin K antagonists or direct thrombin inhibitors, or oral Xa-factor antagonists;
Hypersensitivity to antiplatelet and/or anticoagulant drugs;
Active bleeding or high bleeding risk (severe liver failure, active peptic ulcer, creatinine clearance < 30 mL/min, platelets count < 100.000 mm3);
Uncontrolled systemic hypertension;
Cardiogenic shock;
Previous myocardial revascularization surgery with = 1 internal mammary or radial artery graft;
Documented chronic peripheral arterial disease preventing the use of the femoral technique;
Severe concomitant disease with life expectancy below 12 months;
Participation in drug or devices investigative clinical trials in the last 30 days;
Medical, geographic or social conditions impairing the participation in the study or inability to understand and sign the informed consent term.

Annotated entities:
- Value: "Less than 18 years"
- Person: "age"
- Condition: "Pregnancy"
- Drug: "vitamin K antagonists"
- Multiplier: "Chronic"
- Drug: "direct thrombin inhibitors"
- Drug: "oral Xa-factor antagonists"
- Condition: "Hypersensitivity"
- Drug: "antiplatelet drugs"
- Drug: "anticoagulant drugs"
- Condition: "high bleeding risk"
- Condition: "bleeding"
- Qualifier: "Active"
- Condition: "liver failure"
- Qualifier: "severe"
- Qualifier: "active"
- Condition: "peptic ulcer"
- Measurement: "creatinine clearance"
- Value: "< 30 mL/min"
- Measurement: "platelets count"
- Value: "< 100.000 mm3"
- Qualifier: "Uncontrolled"
- Condition: "systemic hypertension"
- Condition: "Cardiogenic shock"
- Procedure: "myocardial revascularization surgery"
- Temporal: "Previous"
- Device: "internal mammary graft"
- Device: "radial artery graft"
- Multiplier: "= 1"
- Qualifier: "chronic"
- Condition: "peripheral arterial disease"
- Procedure: "femoral technique"
- Negation: "preventing"
- Qualifier: "Severe"
- Temporal: "concomitant"
- Condition: "disease"
- Observation: "life expectancy"
- Value: "below 12 months"
- Non-query-able: "Participation in drug or devices investigative clinical trials in the last 30 days;"
- Post-eligibility: "Medical, geographic or social conditions impairing the participation in the study or inability to understand and sign the informed consent term."